When was vaxchora first licensed by the FDA?

Vaxchora was licensed by the FDA on June 10 2016.